forced expiratory volume in 1s : forced vital capacity ratio > 0.75

The above is a clinical trial inclusion criterion. Annotated with entity spans:
[Measurement: forced expiratory volume in 1s : forced vital capacity ratio] [Value: > 0.75]